¿Qué células sintetizan el tromboxano A2 que se libera en las primeras fases de activación de los mecanismos hemostáticos?:
1. Neurotrófilos.
2. Plaquetas.
3. Megacariocitos.
4. Eritrocitos.

Respuesta correcta: 2. Plaquetas.